Clinical trial exclusion criteria:
Preexisting untreated medical condition (thyroid disease, diabetes mellitus, hypertension, pulmonary conditions, cardiac condition…)
History of three or more consecutively failed In Vitro Fertilization (IVF) cycles after embryo transfer
History of three or more miscarriages
Previous allergy reactions to progesterone products

Annotated entities:
- Condition: "medical condition"
- Qualifier: "untreated"
- Condition: "thyroid disease"
- Condition: "diabetes mellitus"
- Condition: "hypertension"
- Condition: "pulmonary conditions"
- Condition: "cardiac condition"
- Qualifier: "Preexisting"
- Multiplier: "three or more"
- Procedure: "In Vitro Fertilization"
- Procedure: "IVF"
- Qualifier: "consecutively failed"
- Temporal: "after embryo transfer"
- Reference_point: "embryo transfer"
- Procedure: "embryo transfer"
- Multiplier: "three or more"
- Condition: "miscarriages"
- Condition: "allergy"
- Drug: "progesterone products"